Clinical trial exclusion criterion:
History of neuropathy

Annotated entities:
- Condition: "neuropathy"